Clinical trial exclusion criterion:
Increase in creatinine of 15% or greater within one month (30 days) of the screening visit

Annotated entities:
- Measurement: "creatinine"
- Value: "Increase of 15% or greater"
- Temporal: "within one month"
- Temporal: "30 days"